Gartner duct cyst 是：
A. Skene duct origin
B. Müllerian duct origin
C. Mesonephric origin
D. Bartholin duct origin

正確答案：C. Mesonephric origin